對「鎖入症候群（lock-in syndrome）」的敘述，下列何項明顯錯誤？
A. 四肢無力
B. 兩側橋腦（pons）病變引起
C. 眼球左右共軛注視（conjugate gaze）功能正常
D. 皮質延髓徑（corticobular tract）部分受損

正確答案：C. 眼球左右共軛注視（conjugate gaze）功能正常